A history of severe bleeding or bleeding disorders

The above is a clinical trial exclusion criterion. Annotated with entity spans:
A [Temporal: history] of [Qualifier: severe] [Condition: bleeding] or [Condition: bleeding disorders]